Clinical trial exclusion criteria:
Participant has a clinically significant abnormal physical examination, vital signs or 12 lead ECG (including QTc greater than (>) 450msec, Left Bundle Branch Block, permanent pacemaker or implantable cardioverter defibrillator) at Screening or admission
Participant has a history of or current liver or renal insufficiency; significant cardiac, vascular, pulmonary, gastrointestinal, endocrine, neurologic, hematologic, rheumatologic, psychiatric, or metabolic disturbances
Use of any prescription or over-the-counter medication, herbal medication, vitamins, or mineral supplements within 14 days prior to study drug administration (not including paracetamol). Medication for chronic use in age related disease will be allowed after approval by both the investigator and to the sponsor. No change in dose or regimen will be permitted during the study that is, from the Screening visit until the follow-up visit
Participant has a history of spontaneous, prolonged or severe bleeding of unclear origin
Participant has a history of epilepsy or fits or unexplained black-outs other than vasovagal collapse

Annotated entities:
- Undefined_semantics: "clinically significant"
- Qualifier: "clinically significant"
- Condition: "abnormal physical examination"
- Undefined_semantics: "abnormal physical examination"
- Condition: "abnormal vital signs"
- Condition: "abnormal 12 lead ECG"
- Measurement: "QTc"
- Value: "greater than (>) 450msec"
- Condition: "Left Bundle Branch Block"
- Device: "permanent pacemaker"
- Condition: "implantable cardioverter defibrillator"
- Temporal: "at Screening or admission"
- Reference_point: "Screening"
- Reference_point: "admission"
- Condition: "renal insufficiency"
- Condition: "liver insufficiency"
- Temporal: "history"
- Condition: "metabolic disturbances"
- Condition: "psychiatric disturbances"
- Condition: "rheumatologic disturbances"
- Condition: "hematologic disturbances"
- Condition: "neurologic disturbances"
- Condition: "endocrine disturbances"
- Condition: "gastrointestinal disturbances"
- Condition: "pulmonary disturbances"
- Condition: "vascular disturbances"
- Condition: "cardiac disturbances"
- Qualifier: "significant"
- Subjective_judgement: "significant"
- Undefined_semantics: "significant"
- Drug: "any prescription"
- Undefined_semantics: "any prescription"
- Drug: "over-the-counter medication"
- Undefined_semantics: "over-the-counter medication"
- Drug: "herbal medication"
- Drug: "vitamins"
- Drug: "mineral supplements"
- Temporal: "within 14 days prior to study drug administration"
- Reference_point: "study drug administration"
- Drug: "paracetamol"
- Negation: "not"
- Drug: "Medication"
- Condition: "age related disease"
- Undefined_semantics: "age related disease"
- Multiplier: "chronic use"
- Undefined_semantics: "Medication"
- Grammar_Error: "will be allowed"
- Subjective_judgement: "approval by both the investigator and to the sponsor"
- Not_a_criteria: "No change in dose or regimen will be permitted during the study that is, from the Screening visit until the follow-up visit"
- Condition: "bleeding"
- Qualifier: "unclear origin"
- Qualifier: "severe"
- Qualifier: "prolonged"
- Qualifier: "spontaneous"
- Temporal: "history"
- Undefined_semantics: "bleeding"
- Condition: "epilepsy"
- Condition: "fits"
- Condition: "black-outs"
- Qualifier: "unexplained"
- Condition: "vasovagal collapse"
- Negation: "other than"
- Temporal: "history"